Clinical trial inclusion criterion:
Body Mass Index of 30-40 kg/m2, inclusive. Heterozygous subjects may have a broader BMI range; to be eligible heterozygous subjects may have a BMI 27 -55 kg/ m2, inclusive.

Entity relations:
- Has_value("Body Mass Index", "30-40 kg/m2, inclusive")
- Has_value("BMI", "27 -55 kg/ m2, inclusive")